3. Patients with DN must have had Type I or II diabetes and painful distal symmetric sensorimotor polyneuropathy with or without dynamic allodynia of the lower extremities

The above is a clinical trial inclusion criterion. Annotated with entity spans:
3. Patients with [Condition: DN] must have had [Condition: Type I] or II diabetes and [Qualifier: painful] [Qualifier: distal] [Qualifier: symmetric] [Condition: sensorimotor polyneuropathy] with or without [Condition: dynamic allodynia] of the lower extremities